Clinical trial exclusion criterion:
Patients with central canal stenosis.

Annotated entities:
- Condition: "central canal stenosis"